The virus that causes FIP, Feline Infectious Peritonitis belongs to what family?

Feline coronavirus (fcov) is an etiological agent that causes a benign enteric illness and the fatal systemic disease feline infectious peritonitis (fip).